細菌性肝膿瘍（pyogenic liver abscess）的病人最常見的症狀是發冷、發燒，下列何項解剖構造或原因較不可能是肝臟暴露於細菌的途徑？
A. biliary tree
B. hepatic vein
C. portal vein
D. trauma 33.

正確答案：B. hepatic vein